Clinical trial inclusion criterion:
The thickness of the nerve must be at least 2 mm in short axis and at least 5 mm in the longitudinal axis.

Annotated entities:
- Measurement: "thickness of the nerve in short axis"
- Value: "at least 2 mm"
- Value: "at least 5 mm"
- Measurement: "thickness of the nerve in the longitudinal axis"